Patients who are expected to need systemic antiviral therapy other than that provided by the study at any time during their participation in the study are also excluded. Exception: patients who have had a limited (<=7 days) course of acyclovir for herpetic lesions more than 1 month prior to the first administration of test drug are not excluded.

The above is a clinical trial exclusion criterion. Annotated with entity spans:
Patients who are [Mood: expected to need] [Procedure: systemic antiviral therapy] other than that provided by the study [Temporal: at any time during their participation in the study] are also excluded. [Negation: Exception]: patients who have had a [Multiplier: limited] ([Multiplier: <=7 days]) course of [Drug: acyclovir] for [Condition: herpetic lesions] [Temporal: more than 1 month prior to the first administration of test drug] are [Mood: not excluded].